Clinical trial exclusion criterion:
Anticipate not being available or able to comply with the schedule of study visits

Annotated entities:
- Post-eligibility: "Anticipate not being available or able to comply with the schedule of study visits"